A positive test for Human Immunodeficiency Virus (HIV) antibody.

The above is a clinical trial exclusion criterion. Annotated with entity spans:
A [Value: positive] test for [Measurement: Human Immunodeficiency Virus (HIV) antibody].